What does Retapamulin treat?

Retapamulin  is a small molecule covalently binding and inhibiting the bacterium Staphylococcus aureus (MRSA).